根據聯合國救難組織建議，關於災區水的供應，下列何者正確？
A. 5 歲以上災區幼童最常見死因是感染性腹瀉
B. 供水站要儘量與災民居所遠離，至少要距離 100 公尺，以免水被污染
C. 每個人每天約需要 15~20 公升的水
D. 水的最大污染源為小便

正確答案：C. 每個人每天約需要 15~20 公升的水